Clinical trial exclusion criterion:
Patients who do not give informed consent

Annotated entities:
- Non-query-able: "Patients who do not give informed consent"